Clinical trial exclusion criterion:
Diagnosed psychiatric or cognitive disorders

Entity relations:
- OR("psychiatric disorders", "cognitive disorders")